The patient is unwilling to provide informed consent

The above is a clinical trial exclusion criterion. Annotated with entity spans:
[Informed_consent: The patient is unwilling to provide informed consent]